Hemoglobin > or = to 11.5g/dL

The above is a clinical trial inclusion criterion. Annotated with entity spans:
[Measurement: Hemoglobin] [Value: > or = to 11.5g/dL]